下列何分子之缺陷不會影響到淋巴球的基因重組，但會使淋巴球的成熟受到阻礙？
A. IL-2 receptor γc chain
B. RAG 1
C. RAG 2
D. DNA-dependent protein kinase

正確答案：A. IL-2 receptor γc chain